Clinical trial exclusion criterion:
Teeth that are not restorable

Annotated entities:
- Observation: "Teeth that are not restorable"